有關勃起功能障礙的敘述，下列何者正確？
A. 每位病人應接受夜間陰莖勃起試	（nocturnal penile tumescence test）
B. 要補充男性荷爾蒙
C. 第一線檢查應使用彩色都卜勒超音波
D. 高血脂、糖尿病及高血壓會引起海綿體血管內皮細胞功能失調

正確答案：D. 高血脂、糖尿病及高血壓會引起海綿體血管內皮細胞功能失調